Clinical trial exclusion criterion:
Age < 18 years

Annotated entities:
- Person: "Age"
- Value: "< 18 years"